Clinically significant systemic disease (such as diabetes, metabolic syndrome, immunological diseases, diagnosed thrombophilia, porphyria, or any other medical condition requiring the use of low-molecular weight heparin therapy)

The above is a clinical trial exclusion criterion. Annotated with entity spans:
[Qualifier: Clinically significant] [Condition: systemic disease] (such as [Condition: diabetes], [Condition: metabolic syndrome], [Condition: immunological diseases], [Condition: diagnosed thrombophilia], [Condition: porphyria], or any other [Condition: medical condition] requiring the use of [Drug: low-molecular weight heparin] therapy)